What drug, used to treat rheumatoid arthritis, is an interleukin-1 receptor antagonist?

Anakinra is an oral, small molecule, poly (ADP-ribose) polymerase inhibitor that binds to and inactivates the interleukin-1 receptor (IL1R) signaling pathway and is used to treat rheumatoid arthritis